Presence of contraindication to cervical cerclage.

The above is a clinical trial exclusion criterion. Annotated with entity spans:
Presence of [Condition: contraindication] to [Procedure: cervical cerclage].